History of neuropathic pain, chronic pain syndrome, or preoperative use of narcotic or neuropathic pain medicine

The above is a clinical trial exclusion criterion. Annotated with entity spans:
[Temporal: History] of [Condition: neuropathic pain], [Condition: chronic pain syndrome], or [Temporal: preoperative] use of [Drug: narcotic] or [Drug: neuropathic pain medicine]